Clinical trial exclusion criterion:
Dependence upon opioids

Annotated entities:
- Condition: "Dependence upon opioids"